An oral temperature >100.4° or acute disease within 72 hours prior to vaccination, defined as the presence of a moderate or severe illness (as determined by the investigator through medical history and physical examination; for example, those requiring an absence from work) with or without fever.

The above is a clinical trial exclusion criterion. Annotated with entity spans:
An [Measurement: oral temperature] [Value: >100.4°] or [Condition: acute disease] [Temporal: within 72 hours prior to vaccination], defined as the presence of a [Condition: moderate] or [Condition: severe illness] (as determined by the investigator through medical history and physical examination; for example, those requiring an absence from work) with or without fever.